Which histone mark is recognized by HP1?

h3k9me3 is the major histone mark that is recognized by hp1.